What pathological phenotype could potentially concomitant pomegranate juice and rosuvastatin use cause?

Concomitant use of rosuvastatin and pomegranate juice has been hypothesized to be associated with the development of rhabdomyolysis in a case report.